moderate-to-severe depression (> 25 points on the Beck Depression Inventory)

The above is a clinical trial exclusion criterion. Annotated with entity spans:
[Qualifier: moderate-to-severe] [Condition: depression] ([Value: > 25 points] on the [Measurement: Beck Depression Inventory])